60 歲男性，因胸痛冒冷汗被送到急診室，診斷為心肌梗塞，在急診室緊急給與 t-PA（tissue plasminogen activator）藥物，以下敘述何者錯誤？
A. 心肌無法從心房或心室的血液中得到養分，必須仰賴額外的冠狀動脈系統
B. 由膽固醇、不正常的平滑肌細胞和吞噬細胞等組成的動脈粥狀硬化（atherosclerosis）是造成梗塞的主因
C. 給與血管擴張劑，因可以減少周邊阻力，降低 afterload，可以減輕梗塞之心臟的負荷
D. t-PA 主要可以抑制血小板聚集，阻礙後續血栓之形成，故用於心肌梗塞之治療

正確答案：D. t-PA 主要可以抑制血小板聚集，阻礙後續血栓之形成，故用於心肌梗塞之治療